Clinical trial exclusion criterion:
Prior history of citalopram treatment failure at appropriate doses and duration

Annotated entities:
- Drug: "citalopram"
- Temporal: "history"
- Temporal: "Prior"
- Procedure: "treatment"
- Qualifier: "failure"
- Context_Error: "Prior history of citalopram treatment failure at appropriate doses and duration"